Clinical trial inclusion criterion:
Group 2: Healthy subjects without known psoriatic disease or cardiovascular disease

Entity relations:
- Has_negation("psoriatic disease", "without")
- OR("psoriatic disease", "cardiovascular disease")